Clinical trial inclusion criterion:
Height 150 - 180 cm

Annotated entities:
- Measurement: "Height"
- Value: "150 - 180 cm"